男性 60 歲，主訴運動性氣促、疲倦，下肢水腫已有 2 個月，理學檢查發現血壓 160/40 mmHg，胸骨左緣聽診有第 3 度舒張期合併收縮期心雜音，且觸診顯示左心肥大，肝臟腫大約三指幅寬，下肢明顯水腫，實驗室檢查 BUN 30 mg/dL，Cr 1.4 mg/dL，AST 50 IU/L，ALT 60 IU/L，則病人最有可能患有：
A. 腎衰竭
B. 肝腫瘍
C. 心衰竭
D. 呼吸衰竭

正確答案：C. 心衰竭